Clinical trial exclusion criterion:
History of tobacco or tobacco product use unless abstinent for at least one year prior to the Screening Visit. This criterion does not apply to heterozygous subjects.

Entity relations:
- Has_index("for at least one year prior to the Screening Visit", "the Screening Visit")
- Has_temporal("abstinent", "for at least one year prior to the Screening Visit")
- Has_negation("abstinent", "unless")
- Has_temporal("tobacco use", "History")
- AND("tobacco use", "abstinent")
- OR("tobacco use", "tobacco product use")